Clinical trial exclusion criterion:
Bifurcation lesion requiring 2 stenting technique

Annotated entities:
- Condition: "Bifurcation lesion"
- Multiplier: "2"
- Procedure: "stenting technique"